Clinical trial inclusion criterion:
Patients should have at least 12 teeth present

Entity relations:
- Has_multiplier("teeth present", "at least 12")